Chronic liver disease or cirrhosis

The above is a clinical trial exclusion criterion. Annotated with entity spans:
[Condition: Chronic liver disease] or [Condition: cirrhosis]